Acute liver injury (liver aminotransferase concentrations >5 times the upper limit of normal)

The above is a clinical trial exclusion criterion. Annotated with entity spans:
[Condition: Acute liver injury] ([Measurement: liver aminotransferase concentrations] [Value: >5 times the upper limit of normal])